What syndrome is associated with mutations in lysine methyltransferase 2D KMT2D?

Mutations in lysine methyltransferase 2D (KMT2D) cause Kabuko syndrome.